Patients previously treated with HP eradication therapy

The above is a clinical trial exclusion criterion. Annotated with entity spans:
Patients previously treated with [Procedure: HP eradication therapy]